關於綠膿桿菌（Pseudomonas）對指甲的感染，下列敘述何者正確？
A. 菌種因產生 pyocyanin 及 pyoverdin，使指甲呈綠色
B. 具有高傳染力，會迅速傳給周圍指甲
C. 拔除感染的指甲，為治療首選
D. 常伴隨系統性綠膿桿菌的感染

正確答案：A. 菌種因產生 pyocyanin 及 pyoverdin，使指甲呈綠色